在體外循環支持下，將主動脈根部夾住使心臟停止跳動以利手術之進行，但會造成心肌缺血，有各種方法來保護心肌以免造成不可逆的傷害。下列何種方法並沒有保護心肌的效果？
A. 使用高鉀麻痺保護液灌流
B. 頭低腳高姿勢，使血液流向頭腦部，以避免心肌溫度升高
C. 左心室引流（venting of left heart）
D. 心包膜腔使用冰水灌流

正確答案：B. 頭低腳高姿勢，使血液流向頭腦部，以避免心肌溫度升高